Clinical trial inclusion criterion:
Total back pain as measured by visual analog scale (VAS) = 40 mm (0-100 mm) at baseline

Annotated entities:
- Measurement: "visual analog scale (VAS)"
- Value: "= 40 mm"
- Temporal: "at baseline"
- Condition: "Total back pain"